下列何種無脈搏電活性（pulseless electric activity，PEA）病人，接受碳酸氫鈉（sodium bicarbonate）治療最有效果？
A. 二氧化碳過高之呼吸性酸血症病人
B. 心電圖顯示竇性心律且窄的QRS波型之出血性休克病人
C. 心電圖呈現每分鐘45下且寬的QRS波形之高血鉀病人
D. 心跳呼吸停止之代謝性酸血症病人

正確答案：C. 心電圖呈現每分鐘45下且寬的QRS波形之高血鉀病人